Clinical trial inclusion criterion:
Surgery scheduled to last at least 2 hours (including time for anesthesia induction, etc)

Annotated entities:
- Procedure: "Surgery"
- Qualifier: "scheduled to last at least 2 hours"
- Non-representable: "including time for anesthesia induction, etc"